Lovastatin 與 compactin 是用來治療家族性高膽固醇症（familial hypercholesterolemia）的常用藥物，這兩種藥物主要是藉由抑制那一種酵素活性，進而降低細胞內膽固醇的合成？
A. HMG-CoA synthase
B. HMG-CoA lyase
C. HMG-CoA reductase
D. HMG-CoA isomerase

正確答案：C. HMG-CoA reductase